Clinical trial exclusion criterion:
9. Diabetes agents: glibenclamide, glyburide

Entity relations:
- OR("glibenclamide", "glyburide")